Clinical trial inclusion criterion:
Age: 14-80 years

Entity relations:
- Has_value("Age", "14-80 years")